Which are the coactivators of the Yes-associated protein (yap)?

The Yap protein forms complex with Tead (TEA domain) transcription factors.